Positive result of Cross Match.

The above is a clinical trial exclusion criterion. Annotated with entity spans:
[Value: Positive] result of [Procedure: Cross Match].